Clinical trial inclusion criterion:
4. Has an upper arm circumference which is adequate for proper fit of the EMG monitor (at least 14cm).

Entity relations:
- Subsumes("adequate for proper fit of the EMG monitor", "at least 14cm")
- Has_qualifier("upper arm circumference", "adequate for proper fit of the EMG monitor")